下列何者是最符合心動週期（cardiac cycle）中心房壓（atrial pressure）、心室壓（ventricular pressure）與主動脈壓（aortic pressure）相對關係的描述？
A. 除了心室充血期（ventricular filling）外，心房壓都小於主動脈壓
B. 心室射血期（ventricular ejection）中，心室壓小於主動脈壓
C. 等容心室收縮期（isovolumetric ventricular contraction）中，心室壓大於或等於主動脈壓
D. 等容心室舒張期（isovolumetric ventricular relaxation）中，心室壓大於或等於心房壓

正確答案：D. 等容心室舒張期（isovolumetric ventricular relaxation）中，心室壓大於或等於心房壓